下列激素中，何者的化學結構屬性與其他三者不同？
A. aldosterone
B. 1,25-dihydroxycholecalciferol
C. thyroxine
D. testosterone

正確答案：C. thyroxine